Informed consent: Subjects must give their signed and dated written informed consent to participate.

The above is a clinical trial inclusion criterion. Annotated with entity spans:
[Post-eligibility: Informed consent: Subjects must give their signed and dated written informed consent to participate.]